Clinical trial inclusion criteria:
children and teenagers aged less than 20 years,
history of gastrectomy,
gastric malignancy, including adenocarcinoma and lymphoma,
previous allergic reaction to antibiotics (bismuth, amoxicillin, metronidazole, clarithromycin, tetracycline) and PPI (esomeprazole),
contraindication to treatment drugs,
pregnant or lactating women,
severe concurrent disease,
concomitant use of clopidogrel, or (9) Unwilling to accept random assignment of subjects

Annotated entities:
- Person: "children"
- Person: "teenagers"
- Person: "aged"
- Value: "less than 20 years"
- Temporal: "history"
- Procedure: "gastrectomy"
- Condition: "gastric malignancy"
- Condition: "adenocarcinoma"
- Condition: "lymphoma"
- Drug: "bismuth"
- Drug: "amoxicillin"
- Drug: "metronidazole"
- Drug: "clarithromycin"
- Drug: "tetracycline"
- Drug: "PPI"
- Drug: "esomeprazole"
- Drug: "antibiotics"
- Temporal: "previous"
- Condition: "allergic reaction"
- Condition: "contraindication"
- Drug: "treatment drugs"
- Condition: "pregnant"
- Condition: "lactating"
- Person: "women"
- Qualifier: "severe"
- Temporal: "concurrent"
- Condition: "disease"
- Temporal: "concomitant"
- Drug: "clopidogrel"
- Informed_consent: "Unwilling to accept random assignment of subjects"